Severe gastroesophageal reflux disease

The above is a clinical trial exclusion criterion. Annotated with entity spans:
[Qualifier: Severe] [Condition: gastroesophageal reflux disease]